Clinical trial exclusion criterion:
Currently smokes tobacco (cigarettes)

Entity relations:
- Subsumes("smokes tobacco", "smokes cigarettes")